At the time of Visit 1, there is a plan to initiate IV antibiotics for a pulmonary exacerbation

The above is a clinical trial inclusion criterion. Annotated with entity spans:
[Temporal: At the time of Visit 1], there is a plan to initiate [Drug: IV antibiotics] for a [Condition: pulmonary exacerbation]